What are the 3 types of ultraviolet (UV) solar radiation?

short-wave UVC (200-280 nm), medium-wave UVB (280-320 nm), and long-wave UVA (320-400 nm).